Clinical trial exclusion criterion:
Patients under 18

Entity relations:
- Has_value("under 18", "under 18")